Clinical trial exclusion criterion:
16) Presence of non-MR compatible implants, pregnancy or severe claustrophobia.

Annotated entities:
- Parsing_Error: "16)"
- Device: "non-MR compatible implants"
- Condition: "pregnancy"
- Condition: "claustrophobia"
- Qualifier: "severe"